Cuando las conductas aprendidas por repetición, como por ejemplo ir en coche, se vuelven automáticas y rutinarias, pasan a estar controladas por:
1. La corteza motora primaria.
2. La corteza prefrontal.
3. Los ganglios o núcleos basales.
4. El núcleo central de la amígdala.
5. El hipocampo.

Respuesta correcta: 3. Los ganglios o núcleos basales.